Clinical trial inclusion criterion:
who have been optimized on Guideline Directed treatment for heart failure for at least a month prior to enrolling.

Annotated entities:
- Non-representable: "who have been optimized on Guideline Directed treatment for heart failure for at least a month prior to enrolling."